繼發性無月經症（secondary amenorrhea）的定義是月經多久不來？
A. ≧3 個月以上
B. ≧6 個月以上
C. ≧9 個月以上
D. ≧1 年以上

正確答案：B. ≧6 個月以上